Clinical trial inclusion criterion:
Previous diagnosis of type 2 diabetes, fulfilling at least one of the following criteria: 1) current treatment with oral antidiabetic drugs and/or insulin; 2) a fasting glucose value above 126 mg/dl on at least 2 occasions; 3) blood glucose level at 2 hours after an oral glucose tolerance test is equal to or more than 200 mg/dl; or 4) a glycated hemoglobin (HbA1c) level > 6.5 %

Annotated entities:
- Condition: "type 2 diabetes"
- Multiplier: "at least one"
- Temporal: "Previous"
- Temporal: "current"
- Drug: "oral antidiabetic drugs"
- Drug: "insulin"
- Measurement: "fasting glucose"
- Value: "above 126 mg/dl"
- Multiplier: "on at least 2 occasions"
- Measurement: "blood glucose level"
- Value: "equal to or more than 200 mg/dl"
- Temporal: "at 2 hours after an oral glucose tolerance test"
- Reference_point: "an oral glucose tolerance test"
- Procedure: "oral glucose tolerance test"
- Measurement: "glycated hemoglobin (HbA1c) level"
- Value: "> 6.5 %"